PCOS or polycystic ovary on ultrasound scan.

The above is a clinical trial exclusion criterion. Annotated with entity spans:
[Condition: PCOS] or [Condition: polycystic ovary] on [Procedure: ultrasound scan].